Clinical trial exclusion criterion:
Age younger than 18 yrs. or older than 75 yrs.

Annotated entities:
- Person: "Age"
- Value: "younger than 18 yrs. or older than 75 yrs."